Clinical trial exclusion criterion:
Epidural or subdural hematoma

Annotated entities:
- Condition: "Epidural hematoma"
- Condition: "subdural hematoma"